進入血液中的抗原會在何處被抗原呈獻細胞（antigen-presenting cell, APC）呈獻給 T 淋巴細胞辨識，而活化宿主的特異性免疫反應（specific immunity）？
A. 骨髓（Bone marrow）
B. 黏膜淋巴組織（Mucosa-associated lymphoid tissue；MALT）
C. 心臟（heart）
D. 脾臟（spleen）

正確答案：D. 脾臟（spleen）